Clinical trial inclusion criterion:
CHADS2 score = 2 or CHA2DS2-VASc score (=3)

Annotated entities:
- Measurement: "CHADS2 score"
- Value: "= 2"
- Measurement: "CHA2DS2-VASc score"
- Value: "=3"